Malignancy and other significant medical conditions that will impact follow up within this program.

The above is a clinical trial exclusion criterion. Annotated with entity spans:
[Condition: Malignancy] and other [Qualifier: significant] [Condition: medical conditions] that will impact follow up within this program.